Borden classification is used for which disease?

Borden classification systems is used for the prediction of clinical behavior of cranial dural arteriovenous fistulas.